Clinical trial inclusion criterion:
All patients presenting for elective shoulder arthroscopic procedures will be eligible for enrollment.

Annotated entities:
- Qualifier: "elective"
- Procedure: "shoulder arthroscopic procedures"